Una unidad internacional de actividad enzimática (UI) es la cantidad de enzima que:
1. Transforma 1 μmol de sustrato en producto por litro.
2. Forma 1 mg de producto por decilitro.
3. Transforma 1 μmol de sustrato en producto por minuto.
4. Forma μmol de producto por litro.

Respuesta correcta: 3. Transforma 1 μmol de sustrato en producto por minuto.